下列何者不包括在美國醫學研究院所訂的醫療品質六大目標之中？
A. 病患安全（Patient safety）
B. 有效（Effectiveness）
C. 便利（Convenience）
D. 平等（Equity）

正確答案：C. 便利（Convenience）